¿Qué neurotransmisor se ha asociado con el desarrollo del Trastorno Obsesivo Compulsivo?:
1. Serotonina.
2. Dopamina.
3. Noradrenalina.
4. Somatostatina.

Respuesta correcta: 1. Serotonina.